左側胸骨旁第2肋間處的穿刺傷最可能傷害下列何者？
A. 右心室（right ventricle）
B. 右心房（right atrium）
C. 上腔靜脈（superior vena cava）
D. 肺動脈幹（pulmonary trunk）

正確答案：D. 肺動脈幹（pulmonary trunk）